病人的配偶欲來申請病人之診斷書，須如何處置？
A. 看配偶的身分證即可
B. 配偶口頭表示即可
C. 出示病人的身分證即可
D. 須有配偶的身分證加上載明委託意旨之委託書

正確答案：D. 須有配偶的身分證加上載明委託意旨之委託書